刺激橫膈中央處的壁層胸膜（parietal pleura）所引起的牽涉痛（referred pain），其對應的皮區 （dermatome）為：
A. C3-C5
B. T1-T2
C. T4-T5
D. T7-T8

正確答案：A. C3-C5